patient 18 years old and more

The above is a clinical trial inclusion criterion. Annotated with entity spans:
patient 18 years [Person: old] [Value: and more]